33歲健康女性，突發劇烈頭痛及暈厥（syncope），病人清醒後有頭痛、嘔吐及頸部酸痛現象，此時最優先的 檢查為何？
A. 不打顯影劑的腦部電腦斷層
B. 打顯影劑的腦部電腦斷層
C. 打顯影劑的腦部磁振造影
D. 血管攝影

正確答案：A. 不打顯影劑的腦部電腦斷層